Clinical trial inclusion criterion:
Active chronic central serous chorioretinopathy (cCSC);

Annotated entities:
- Qualifier: "Active"
- Qualifier: "chronic"
- Condition: "central serous chorioretinopathy (cCSC)"